Clinical trial exclusion criterion:
Contraindication for IR-MPH use

Entity relations:
- AND("Contraindication", "IR-MPH")